Clinical trial exclusion criterion:
Iloprost cure carried out in the previous month or planned in the following month.

Annotated entities:
- Drug: "Iloprost"
- Temporal: "in the previous month"
- Temporal: "in the following month"
- Mood: "planned"
- Drug: "Iloprost"
- Non-query-able: "planned in the following month"